Clinical trial exclusion criterion:
pregnancy, breast feeding

Annotated entities:
- Condition: "pregnancy"
- Observation: "breast feeding"